Organ dysfunction, and significant developmental delays or behavior problems

The above is a clinical trial exclusion criterion. Annotated with entity spans:
[Condition: Organ dysfunction], and [Qualifier: significant] [Condition: developmental delays] or [Condition: behavior problems]